Clinical trial inclusion criterion:
LA size < 65

Annotated entities:
- Measurement: "LA size"
- Value: "< 65"